Clinical trial inclusion criterion:
Hyperglycemic (Glucose level > 126 mg/dL)

Entity relations:
- Has_value("Glucose level", "> 126 mg/dL")
- AND("Hyperglycemic", "Glucose level")